Clinical trial inclusion criterion:
Subject has a documented or suspected metal sensitivity.

Annotated entities:
- Condition: "sensitivity"
- Device: "metal"
- Mood: "documented"
- Mood: "suspected"